Patients with clinically significant laboratory abnormalities / disorders other than prostate cancer

The above is a clinical trial exclusion criterion. Annotated with entity spans:
[Non-query-able: Patients with clinically significant laboratory abnormalities / disorders other than prostate cancer]